一位 50 歲男性，因為慢性阻塞性肺病合併呼吸衰竭，在接受氣管內管插管後由他院轉入，到院時呈昏迷狀態，無脈搏，但心電圖監視器出現竇性頻脈（sinus tachycardia），理學檢查發現病患臉色蒼白、頸靜脈鼓脹、單側肺音消失合併明顯叩診鼓音（hyperresonance），此時除了施予基本救命術（basic life support）外，應作何處置？
A. 會診胸腔外科醫師
B. 胸部 X 光檢查
C. 針刺減壓及置放胸管
D. 大量輸液灌注

正確答案：C. 針刺減壓及置放胸管